45歲女性糖尿病患，3天前於右側額部出現叢集樣水疱（grouped vesicles）合併紅斑，同側鼻尖亦出現數個水疱，下列何者為最需要之檢查？
A. 皮膚劃紋反應（dermatographism）
B. KOH鏡檢
C. 眼科檢查
D. 伍氏燈檢查（Wood's light examination）

正確答案：C. 眼科檢查